Clinical trial inclusion criterion:
individuals engaging in transactional sex (i.e sex for money, drugs, or housing)

Annotated entities:
- Observation: "transactional sex"
- Observation: "sex for money"
- Observation: "sex for drugs"
- Observation: "sex for housing"